Clinical trial inclusion criterion:
Measurable disease

Annotated entities:
- Context_Error: "Measurable disease"